股三角（femoral triangle）常用來測量中心靜脈壓（CVP），以下有關股三角的敘述，何者錯誤？
A. 由腹股溝韌帶、縫匠肌、內收長肌構成
B. 股靜脈、股動脈、股神經的關係為股靜脈在最外側，股神經在最內側
C. 髂腰肌、恥骨肌為其底部
D. 有豐富的淋巴組織

正確答案：B. 股靜脈、股動脈、股神經的關係為股靜脈在最外側，股神經在最內側